Unable to complete baseline testing, pre-existing neurological deficit

The above is a clinical trial exclusion criterion. Annotated with entity spans:
[Non-query-able: Unable to complete baseline testing], [Qualifier: pre-existing] [Condition: neurological deficit]